9. History of myocardial infarction, angina, congestive heart failure, cardiomyopathy, stroke or transient ischemic attack, or any heart condition currently under medical care.

The above is a clinical trial exclusion criterion. Annotated with entity spans:
[Parsing_Error: 9.] [Temporal: History] of [Condition: myocardial infarction], [Condition: angina], [Condition: congestive heart failure], [Condition: cardiomyopathy], [Condition: stroke] or [Condition: transient ischemic attack], or any [Undefined_semantics: heart condition currently under medical care].